patients scheduled for elective breast mastectomy or quadrantectomy

The above is a clinical trial inclusion criterion. Annotated with entity spans:
patients scheduled for [Qualifier: elective] [Procedure: breast] [Procedure: mastectomy] or quadrantectomy